Other spinal pathology or other associated medical condition

The above is a clinical trial exclusion criterion. Annotated with entity spans:
Other [Condition: spinal pathology] or other [Condition: associated medical condition]